Clinical trial exclusion criterion:
History of TBI more severe than mild by DVBIC criteria

Annotated entities:
- Condition: "TBI"
- Value: "more severe than mild"
- Measurement: "DVBIC criteria"